Clinical trial exclusion criterion:
Non-resident of Scotland

Entity relations:
- AND("Non-resident", "Scotland")